一位 13 歲男孩，無受傷病史，一年來背部愈來愈駝背；雖然父母一再提醒挺胸，但其駝背仍愈來愈明顯。胸腰椎 X 光檢查發現第十一、十二胸椎及第一腰椎有楔形變形（wedge deformity），且楔形角度均超過五度。以下何者是最可能之診斷？
A. 姿勢性駝背（postural kyphosis）
B. 先天性駝背（congenital kyphosis）
C. 休門氏駝背（Scheuermann's kyphosis）
D. 脊椎骨折（spine fracture）

正確答案：C. 休門氏駝背（Scheuermann's kyphosis）